下列何者不是典型之甲狀腺功能亢進（hyperthyroidism）的症狀？
A. 女性病患之月經量減少及月經週期不規則
B. 體重增加
C. 心悸或心律不整
D. 怕熱

正確答案：B. 體重增加